uncontrolled intercurrent illness

The above is a clinical trial exclusion criterion. Annotated with entity spans:
[Qualifier: uncontrolled] [Condition: intercurrent illness]